Clinical trial exclusion criterion:
Undiagnosed vaginal bleeding.

Entity relations:
- Has_qualifier("vaginal bleeding", "Undiagnosed")